La fibra muscular cardiaca:
1. Se une a otras fibras mediante discos intercalares.
2. Está inervada por el Sistema Nervioso Somático.
3. Presenta triadas bien desarrolladas.
4. Posee de 2 a 3 núcleos en posición central.

Respuesta correcta: 1. Se une a otras fibras mediante discos intercalares.